Clinical trial exclusion criterion:
Current or past history of any significant psychiatric disorder including, but not limited to, depression (treatment with antidepressants), bipolar disorder, or schizophrenia.

Annotated entities:
- Condition: "psychiatric disorder"
- Qualifier: "significant"
- Condition: "depression"
- Drug: "antidepressants"
- Condition: "bipolar disorder"
- Condition: "schizophrenia"